35歲習慣性流產女性 G3P0SA3，因為不孕症合併月經異常至門診求診，月經週期第3天賀爾蒙指數濾泡刺激激素（FSH）5.4 IU/L，黃體化激素（LH）3.0 IU/L，甲狀腺刺激激素（TSH）5.87 mIU/L以及泌乳激素 （PRL）15 ng/mL，其他檢查包括抗甲狀腺抗體陽性以及甲狀腺素free T4正常。下列何者是首先建議的治療方法？
A. 人工授精（IUI）
B. 試管嬰兒（IVF）合併植入前胚胎鑑定
C. 甲狀腺素levothyroxine治療
D. Bromocriptine減少泌乳激素合成

正確答案：C. 甲狀腺素levothyroxine治療